Patients with STEMI undergoing primary PPCI

The above is a clinical trial inclusion criterion. Annotated with entity spans:
Patients with [Condition: STEMI] undergoing [Procedure: primary PPCI]